Clinical trial exclusion criterion:
Significant cognitive impairment, defined as a known diagnosis of dementia or a Mini-Mental State Examination exam score < 24

Annotated entities:
- Condition: "cognitive impairment"
- Qualifier: "Significant"
- Condition: "dementia"
- Measurement: "Mini-Mental State Examination"
- Value: "score < 24"